4. Diseases:

The above is a clinical trial exclusion criterion. Annotated with entity spans:
[Parsing_Error: 4.] [Parsing_Error: Diseases:]